Clinical trial inclusion criterion:
1. low serum levels of HDL cholesterol (<40 mg⁄dL for men or < 50 mg ⁄dL for women);

Annotated entities:
- Measurement: "serum levels of HDL cholesterol"
- Value: "low"
- Value: "<40 mg⁄dL"
- Value: "< 50 mg ⁄dL"
- Person: "men"
- Person: "women"